Clinical trial exclusion criterion:
Major surgery within 4 weeks

Entity relations:
- Has_temporal("Major surgery", "within 4 weeks")